做 Radical neck dissection 後，有 Shoulder dysfunction，請問係那一對顱神經受損？
A. 第九對
B. 第十對
C. 第十一對
D. 第十二對

正確答案：C. 第十一對